Clinical trial inclusion criterion:
Written informed consent

Annotated entities:
- Non-query-able: "Written informed consent"